下列何者不是妊娠劇吐症（hyperemesis gravidarum）的典型表現？
A. 腹痛
B. 體重減輕
C. 酮血症（ketonemia）
D. 低血鉀

正確答案：A. 腹痛